Clinical trial exclusion criterion:
Any other physical or psychiatric condition that may impair their ability to cooperate with study data collection.

Annotated entities:
- Post-eligibility: "Any other physical or psychiatric condition that may impair their ability to cooperate with study data collection."